cerebrospinal fluid 由下列何者分泌？
A. arachnoid membrane
B. choroid plexus
C. arachnoidal villi
D. ependyma

正確答案：B. choroid plexus